Clinical trial exclusion criterion:
history of multiple severe hypoglycemic episodes within the last two years

Entity relations:
- Has_qualifier("hypoglycemic episodes", "severe")
- Has_multiplier("hypoglycemic episodes", "multiple")
- Has_temporal("hypoglycemic episodes", "last two years")